Clinical trial exclusion criterion:
Patients who have received the last administration of an anticancer therapy including chemotherapy, immunotherapy, hormonal therapy and monoclonal antibodies </= 2 weeks prior to starting the study drug, or who have not recovered from the side effects of such therapy

Annotated entities:
- Procedure: "anticancer therapy"
- Procedure: "chemotherapy"
- Procedure: "immunotherapy"
- Procedure: "hormonal therapy"
- Drug: "monoclonal antibodies"
- Temporal: "</= 2 weeks prior to starting the study drug"
- Reference_point: "starting the study drug"
- Condition: "recovered from the side effects of such therapy"